Clinical trial exclusion criterion:
Scheduled cardiac resynchronization therapy or heart transplantation.

Entity relations:
- OR("cardiac resynchronization therapy", "heart transplantation")